手腕屈肌支持帶（flexor retinaculum）的外側附著於何處？
A. 舟狀骨（scaphoid）及月狀骨（lunate）
B. 大多角骨（trapezium）及小多角骨（trapezoid）
C. 舟狀骨（scaphoid）及大多角骨（trapezium）
D. 橈骨莖突（radial styloid process）

正確答案：C. 舟狀骨（scaphoid）及大多角骨（trapezium）